一病人有狼瘡病腎炎（lupus nephritis），有蛋白尿2.0 gm/day，合併腎功能不足（creatinine 2.0 mg/dL），下列何種藥物，最不適用於此病人？
A. cyclosporine
B. leflunomide
C. rituximab
D. mycofenolate mofetil

正確答案：A. cyclosporine